Clinical trial exclusion criterion:
Ester local anesthetic allergy, PABA allergy

Entity relations:
- AND("allergy", "PABA")
- AND("allergy", "Ester local anesthetic")
- OR("allergy", "allergy")